Clinical trial inclusion criterion:
Signed written informed consent form

Annotated entities:
- Informed_consent: "Signed written informed consent form"